Clinical trial exclusion criterion:
Ulcers due to non-diabetic etiology.

Annotated entities:
- Condition: "Ulcers"
- Qualifier: "non-diabetic"